Clinical trial inclusion criteria:
Before participate in the study, patients must understand the treatment plan and willing to participate in the study. Patients must have signed an approved informed consent.
Histopathologic confirmed squamous cell carcinoma of head and neck ,including oral cavity, oropharynx, larynx, or hypopharynx.
Ages=65 years,Not limited to gender.
ECOG performance status =2.
Patients with surgical contraindication or reject to surgery.
Postoperative TNM(primary tumor,regional nodes,metastasis) staging III~IV, positive surgical margin.
without evidence of distant metastases.
No contraindication to chemoradiotherapy.
Life expectancy > 3 months.
Available Organ function: white blood cell=3.5×109/L, Neutrophils =1.5×109/L, Hemoglobin =80g/L, Blood platelet>100×109/L; Alanine aminotransferase (ALT) and Aspartate aminotransferase (AST)= 2.5 upper limit of normal(ULN); Total bilirubin (TBIL) <1.5 ULN;serum creatinine=1.5 ULN; creatinine clearance of = 50ml/min

Annotated entities:
- Post-eligibility: "Before participate in the study, patients must understand the treatment plan and willing to participate in the study. Patients must have signed an approved informed consent."
- Procedure: "Histopathologic"
- Condition: "squamous cell carcinoma"
- Qualifier: "Histopathologic confirmed"
- Qualifier: "head and neck"
- Qualifier: "oral cavity"
- Qualifier: "oropharynx"
- Qualifier: "larynx"
- Qualifier: "hypopharynx"
- Person: "Ages"
- Value: "=65 years"
- Measurement: "ECOG performance status"
- Value: "=2"
- Condition: "contraindication"
- Procedure: "surgical"
- Observation: "reject"
- Procedure: "surgery"
- Measurement: "TNM staging"
- Qualifier: "Postoperative"
- Value: "III~IV,"
- Value: "positive"
- Measurement: "surgical margin"
- Condition: "distant metastases"
- Negation: "without"
- Mood: "evidence"
- Condition: "contraindication"
- Procedure: "chemoradiotherapy"
- Negation: "No"
- Observation: "Life expectancy"
- Value: "> 3 months"
- Measurement: "white blood cell"
- Value: "=3.5×109/L"
- Measurement: "Neutrophils"
- Value: "=1.5×109/L"
- Measurement: "Hemoglobin"
- Value: "=80g/L"
- Measurement: "Blood platelet"
- Value: ">100×109/L"
- Measurement: "Alanine aminotransferase (ALT)"
- Measurement: "Aspartate aminotransferase (AST)"
- Value: "= 2.5 upper limit of normal(ULN)"
- Measurement: "Total bilirubin (TBIL)"
- Value: "<1.5 ULN"
- Measurement: "serum creatinine"
- Value: "=1.5 ULN"
- Measurement: "creatinine clearance"
- Value: "= 50ml/min"